Clinical trial exclusion criterion:
Gastrectomy, biliopancreatic diversion, resection or re-routing of small intestines

Annotated entities:
- Procedure: "Gastrectomy"
- Procedure: "biliopancreatic diversion"
- Procedure: "re-routing"
- Procedure: "resection"
- Qualifier: "small intestines"